No prior surgical treatment in the sites planned for therapy

The above is a clinical trial inclusion criterion. Annotated with entity spans:
[Non-query-able: No prior surgical treatment in the sites planned for therapy]